With which personality traits has the human monoamine oxidase A (MAOA) gene been associated?

Association of monoamine oxidase-A genetic variants and amygdala morphology in violent offenders with antisocial personality disorder and high psychopathic traits. Monoamine oxidase a gene is associated with borderline personality disorder. Gene environment interactions with a novel variable Monoamine Oxidase A transcriptional enhancer are associated with antisocial personality disorder.